Clinical trial exclusion criteria:
Patient does not meet inclusion criteria, discovered after randomization
Inability to give informed consent
Known clotting disorder or use of anticoagulants
Known risk factors for, or presence of, a cardiovascular disease
Language barrier

Annotated entities:
- Post-eligibility: "Patient does not meet inclusion criteria, discovered after randomization"
- Post-eligibility: "Inability to give informed consent"
- Condition: "clotting disorder"
- Drug: "anticoagulants"
- Condition: "cardiovascular disease"
- Observation: "risk factors cardiovascular disease"
- Non-query-able: "Language barrier"